hemoglobin level <90 g/l), thrombocytopenia <100x10^9 / L.

The above is a clinical trial exclusion criterion. Annotated with entity spans:
[Measurement: hemoglobin level] [Value: <90 g/l]), [Condition: thrombocytopenia] [Value: <100x10^9 / L].